What disease is associated with mutations in the MECP2 transcription factor?

Mutations in the MECP2 transcription factor, which codes for the transcription factor ECE1, have been found to be associated with Rett syndrome.